La Conferencia Internacional sobre Atención Primaria de Salud, reunida en Alma-Ata, ¿en qué año se produjo?:
1. 1986.
2. 1978.
3. 1976.
4. 1967.

Respuesta correcta: 2. 1978.